一名 68 歲男性於運動時出現胸悶現象，休息後則會明顯改善。心臟 Thallium-201 核醫檢查發現有左心室前壁缺血（Ischemia）。下列何種血中指標（Marker）可用來預測他未來發生心肌梗塞之可能性？
A. Troponin I 或 Troponin T
B. Circulating antibodies against chlamydia pneumoniae
C. MB isomer of creatine kinase（CK-MB）
D. C-reactive protein

正確答案：D. C-reactive protein